Which transcription factor regulates emergency granulopoiesis?

The transcription factor CCAAT/enhancer binding protein β (C/EBPβ) regulates the differentiation and proliferation of hematopoietic stem cells.